Clinical trial inclusion criterion:
1. Male and female recipients of all races, ≥18 years of age.

Entity relations:
- Has_value("age", "≥18 years")
- OR("Male", "female")